Clinical trial exclusion criterion:
Patient already participating in an other therapeutic trial with an experimental drug

Annotated entities:
- Context_Error: "Patient already participating in an other therapeutic trial with an experimental drug"